8. Left main stenosis of 50% or more;

The above is a clinical trial exclusion criterion. Annotated with entity spans:
8. [Condition: Left main stenosis] of [Value: 50% or more];